Clinical trial inclusion criterion:
M3 (= 25%) marrow on day 15 OR meets SR criteria but M3 marrow on day 15 and *M1 marrow on day 33.

Entity relations:
- Has_value("M3 marrow", "= 25%")
- Has_value("SR criteria", "meets")
- Has_temporal("M1 marrow", "on day 33")
- Has_temporal("M3 marrow", "on day 15")
- Has_temporal("M3 marrow", "on day 15")
- OR("M3 marrow", "SR criteria")